一位 42 歲女性，突然發生嚴重腹部疼痛。已知有膽囊結石許多年。身體檢查發現腹部明顯壓痛，特別是在上腹部，同時腸音也減少。腹部 X 光檢查顯示有明顯組織水腫現象但無游離空氣存在。腹部電腦斷層檢查發現在胰臟部位有腫脹現象且有許多小的鈣化發生。接受治療後逐漸康復。此病最可能發生下列何種後遺症？
A. 胰臟癌（adenocarcinoma）
B. 胃潰瘍（gastric ulcer）
C. 偽囊腫（pseudocyst）
D. 小腸梗塞（small intestine infarction）

正確答案：C. 偽囊腫（pseudocyst）